下列四種細胞，何者最不易出現於正常之子宮內膜中？
A. 嗜中性白血球（neutrophils）
B. 巨噬細胞（macrophages）
C. 漿細胞（plasma cells）
D. 淋巴球（lymphocytes）

正確答案：C. 漿細胞（plasma cells）